La estimulación de los cuerpos carotídeos:
1. Disminuye el pH en sangre arterial.
2. Disminuye la PCO2
3. Aumenta la concentración de bicarbonato en sangre arterial.
4. Disminuye la PO2 en sangre arterial.

Respuesta correcta: 2. Disminuye la PCO2